Phlorotannin is extracted from what plant?

phlorotannins present in brown seaweeds Phlorotannins, phenolic compounds produced exclusively by seaweeds